下列何處的肌肉組織不是衍生自中胚層（mesoderm）？
A. 肋間（intercostal region）
B. 虹膜（iris）
C. 心臟（heart）
D. 消化道（digestive tract）

正確答案：B. 虹膜（iris）